Active malignancy or history of malignancy.

The above is a clinical trial exclusion criterion. Annotated with entity spans:
[Qualifier: Active] [Condition: malignancy] or [Temporal: history] of [Condition: malignancy].